Clinical trial inclusion criterion:
11. Subjects should be either sexually inactive (abstinent) or agree to use a barrier method with spermicide in the event of sexual activity throughout the study period

Annotated entities:
- Condition: "sexually inactive"
- Condition: "sexually abstinent"
- Device: "barrier method with spermicide"
- Observation: "agree to use"